Clinical trial exclusion criterion:
Participant has a clinically significant abnormal physical examination, vital signs or 12 lead ECG (including QTc greater than (>) 450msec, Left Bundle Branch Block, permanent pacemaker or implantable cardioverter defibrillator) at Screening or admission

Entity relations:
- Has_value("QTc", "greater than (>) 450msec")
- Subsumes("abnormal 12 lead ECG", "QTc")
- Has_index("at Screening or admission", "Screening")
- Has_qualifier("abnormal physical examination", "clinically significant")
- Has_temporal("abnormal physical examination", "at Screening or admission")
- Has_index("at Screening or admission", "Screening")
- Has_index("at Screening or admission", "admission")
- OR("abnormal physical examination", "abnormal 12 lead ECG", "abnormal vital signs")
- OR("QTc", "permanent pacemaker", "Left Bundle Branch Block", "implantable cardioverter defibrillator")
- OR("Screening", "admission")